腎內結石的疼痛經由下列何者傳導？
A. 大內臟神經（greater splanchnic nerve）
B. 小內臟神經（lesser splanchnic nerve）
C. 最小內臟神經（least splanchnic nerve）
D. 迷走神經（vagus nerve）

正確答案：C. 最小內臟神經（least splanchnic nerve）